下列何種腫瘤在小於 20 歲的族群人口中，發生率最高？
A. 腦瘤
B. 骨及關節腫瘤
C. 白血病
D. 淋巴瘤

正確答案：C. 白血病